Clinical trial inclusion criterion:
Without basal disorders of neurology and psychiatrics

Entity relations:
- Has_negation("basal disorders of neurology", "Without")
- OR("basal disorders of neurology", "basal disorders of psychiatrics")